The patient has a contraindication (or an incompatible drug association) for a treatment used in this study

The above is a clinical trial exclusion criterion. Annotated with entity spans:
[Non-representable: The patient has a contraindication (or an incompatible drug association) for a treatment used in this study]